History of neurologic deficit.

The above is a clinical trial exclusion criterion. Annotated with entity spans:
[Temporal: History] of [Condition: neurologic deficit].